Clinical trial exclusion criterion:
Presence of kidney comorbidities

Annotated entities:
- Condition: "kidney comorbidities"